Clinical trial exclusion criterion:
Major bleeding history or bleeding diathesis

Entity relations:
- Has_qualifier("bleeding", "Major")
- Has_temporal("bleeding", "history")
- OR("bleeding", "bleeding diathesis")